Clinical trial exclusion criterion:
7. Platelet count < 100,000

Entity relations:
- Has_value("Platelet count", "< 100,000")